Clinical trial inclusion criterion:
>18 to < 90 years old

Entity relations:
- Has_value("old", ">18 to < 90 years")